Clinical trial exclusion criteria:
Need for long-term oral anticoagulation;
Drug-eluting stent implantation within 3 months prior to TAVI procedure;
Bare-metal stent implantation within 1 month prior to TAVI procedure;
Allergy or intolerance to aspirin or clopidogrel.
Drug-eluting stent implantation within 3 months prior to TAVI procedure;
Bare-metal stent implantation within 1 month prior to TAVI procedure;
Allergy or intolerance to (N)OAC or clopidogrel.

Annotated entities:
- Mood: "Need for"
- Procedure: "long-term oral anticoagulation"
- Device: "Drug-eluting stent"
- Procedure: "implantation"
- Temporal: "within 3 months prior to TAVI procedure"
- Reference_point: "TAVI procedure"
- Procedure: "TAVI procedure"
- Device: "Bare-metal stent"
- Procedure: "implantation"
- Temporal: "within 1 month prior to TAVI procedure"
- Procedure: "TAVI procedure"
- Reference_point: "TAVI procedure"
- Condition: "Allergy"
- Condition: "intolerance"
- Drug: "aspirin"
- Drug: "clopidogrel"
- Device: "Drug-eluting stent"
- Procedure: "implantation"
- Temporal: "within 3 months prior to TAVI procedure"
- Reference_point: "TAVI procedure"
- Procedure: "TAVI procedure"
- Device: "Bare-metal stent"
- Procedure: "implantation"
- Temporal: "within 1 month prior to TAVI procedure"
- Reference_point: "TAVI procedure"
- Procedure: "TAVI procedure"
- Condition: "Allergy"
- Condition: "intolerance"
- Drug: "(N)OAC"
- Drug: "clopidogrel"